Las investigaciones cognitivas de la inteligencia, y por lo que se refiere a la relación entre Tiempo de Reacción (TR) y Cociente Intelectual (CI):
1. Han hallado asociaciones positivas de gran magnitud.
2. Describen relaciones negativas con diferencias en la magnitud, según los estudios.
3. Han encontrado ausencia de asociación ente ambos constructos.
4. No han recibido atención por parte de la comunidad científica.
5. Parten del estudio de las diferencias culturales en inteligencia.

Respuesta correcta: 2. Describen relaciones negativas con diferencias en la magnitud, según los estudios.